Multiple gestation

The above is a clinical trial exclusion criterion. Annotated with entity spans:
[Condition: Multiple gestation]